一位 3 歲女童因嘔吐、意識不清與抽搐等急性腦病變（acute encephalopathy）的症狀送到急診室，檢查發現有代謝性酸血症（metabolic acidosis）合併低血糖、肝功能異常及血氨數值偏高（大約正常最高值三倍），她的服藥病史不明，下列疾病或狀態何者最不可能？
A. 感冒並服用 aspirin
B. 中鏈脂肪酸氧化異常（medium-chain fatty acid oxidation defect）
C. 鳥胺酸氨甲醯基轉移酶缺乏（ornithine transcarbamylase deficiency）
D. 原發性全身肉鹼缺乏症（primary systemic carnitine deficiency）

正確答案：C. 鳥胺酸氨甲醯基轉移酶缺乏（ornithine transcarbamylase deficiency）